Clinical trial exclusion criterion:
1. The subject is a pregnant or lactating female.

Entity relations:
- OR("pregnant", "lactating")